Suspected cobra bite, OR

The above is a clinical trial exclusion criterion. Annotated with entity spans:
[Mood: Suspected] [Condition: cobra bite], OR